El procedimiento para aplicar una escayola incluye:
1. Elegir una venda de 10 cm de ancho.
2. Cubrir la vuelta precedente con un tercio del ancho del vendaje.
3. Manejar la escayola en proceso de secado con las palmas de las manos.
4. Apoyar el miembro escayolado sobre una superficie dura.
5. Cubrir la escayola para permitir su fraguado.

Respuesta correcta: 3. Manejar la escayola en proceso de secado con las palmas de las manos.